Which genes are associated with Epidermolysis Bullosa Simplex?

Keratin 14 gene mutations in patients with epidermolysis bullosa simplex. Mutant keratins 5 or 14 are implicated in the etiology of epidermolysis bullosa simplex (EBS).  Keratin 14 gene point mutation in the Köbner and Dowling-Meara types of epidermolysis bullosa simplex as detected by the PASA method.